Which is the primary enzyme metabolizing esomeprazole?

Esomeprazole is primarily metabolized by CYP2C19.